History of lung transplant.

The above is a clinical trial exclusion criterion. Annotated with entity spans:
[Temporal: History] of [Procedure: lung transplant].